Any medical reason why, in the opinion of the investigator, the patient should not participate

The above is a clinical trial exclusion criterion. Annotated with entity spans:
[Post-eligibility: Any medical reason why, in the opinion of the investigator, the patient should not participate]